Clinical trial exclusion criterion:
2. insertional AT

Annotated entities:
- Condition: "insertional AT"